Clinical trial inclusion criterion:
Anti-GAD antibodies negative (Glutamic Acid Decarboxylase)

Entity relations:
- Has_value("Anti-GAD antibodies (Glutamic Acid Decarboxylase)", "negative")